Comorbidities such as uncontrolled cardiovascular disease, i.e., unstable systemic arterial hypertension, coronary artery disease; previous stroke; OSA; pneumothorax in the last 2 months.

The above is a clinical trial exclusion criterion. Annotated with entity spans:
[Condition: Comorbidities] such as [Qualifier: uncontrolled] [Condition: cardiovascular disease], i.e., [Qualifier: unstable] [Condition: systemic arterial hypertension], [Condition: coronary artery disease]; [Temporal: previous] [Condition: stroke]; [Condition: OSA]; [Condition: pneumothorax] [Temporal: in the last 2 months].